Clinical trial exclusion criteria:
Preexisting ocular diseases or conditions other than age related cataracts, have contraindications for cataract surgery;
Preexisting systemic diseases or conditions that may confound the results of the study;
Previous ocular surgery history or ocular trauma that may confound the results of the study;
Require combined surgery that may confound the results of the study;
Previous participation in other clinical trial within 30 days of this study start;
Systemic or ocular medications that may confound the outcome of the intervention
Pregnant, lactating, or planning to become pregnant during the course of the trial;

Annotated entities:
- Condition: "ocular diseases"
- Temporal: "Preexisting"
- Condition: "conditions"
- Negation: "other than"
- Condition: "cataracts"
- Qualifier: "age related"
- Condition: "contraindications"
- Procedure: "cataract surgery"
- Temporal: "Preexisting"
- Condition: "systemic diseases"
- Condition: "conditions"
- Qualifier: "may confound the results of the study"
- Procedure: "ocular surgery"
- Temporal: "Previous"
- Condition: "ocular trauma"
- Qualifier: "may confound the results of the study"
- Procedure: "combined surgery"
- Mood: "Require"
- Qualifier: "may confound the results of the study"
- Non-query-able: "Previous participation in other clinical trial within 30 days of this study start;"
- Drug: "ocular medications"
- Drug: "Systemic medications"
- Qualifier: "may confound the outcome of the intervention"
- Condition: "Pregnant"
- Condition: "lactating"
- Mood: "planning to become"
- Condition: "pregnant"
- Temporal: "during the course of the trial"